安琪今年 28 歲，G4P0AA3，她結婚前因為不想要太早有小孩作了 3 次人工流產手術（Dilatation and curettage），目前懷孕 18 週，之前並無不適症狀，今天早上起來覺得陰道水狀分泌物增加，所以來到診間求診，檢查結果發現羊水囊已經膨出至陰道內，安琪否認這兩天有任何腹痛或不舒服，下列何種診斷最符合安琪的症狀？
A. 子宮頸閉鎖不全（Cervical incompetence）
B. 脅迫性流產（Threatened abortion）
C. 早產（Preterm labor）
D. 不完全性流產（Incomplete abortion）

正確答案：A. 子宮頸閉鎖不全（Cervical incompetence）